一位 65 歲的男性來求診的原因是近 5、6 個月以來，發現自己聲音變得沙啞，皮膚變得乾燥，毛髮較為粗糙，面部及眼皮浮腫，人很容易覺得疲倦，睡眠的時間延長，食慾較差且有便秘的現象，在為他進行身體檢查時，血壓為 150/100 mmHg，呼吸速率 16/min，體溫 36℃，心跳無雜音，兩側肺部呼吸音正常，腹部檢查肝脾無腫大，腸蠕動較慢，下肢有脛前水腫（pretibial edema）。為這位病人進行問診及身體檢查時，下列何者較不可能出現？
A. 病人看起來比實際年齡老
B. 記憶力減退，注意力較不易集中
C. 脈搏：每分鐘 60 下
D. 體重下降

正確答案：D. 體重下降